Clinical trial inclusion criterion:
Subjects must be 18 years or older

Annotated entities:
- Value: "18 years or older"
- Person: "older"